Clinical trial inclusion criterion:
Low back pain of less than six weeks' duration; and at least moderate pain intensity (NRS<U+2267>4)

Annotated entities:
- Condition: "Low back pain"
- Temporal: "less than six weeks' duration"
- Value: "at least moderate"
- Measurement: "pain intensity"
- Measurement: "NRS"
- Value: "4"